Clinical trial inclusion criterion:
5. Written informed consent from patient or attending relative able to and willing to give informed consent. Consent form and information sheets will be translated into Malay and copies provided to the patient.

Annotated entities:
- Parsing_Error: "5."
- Non-query-able: "Written informed consent from patient or attending relative able to and willing to give informed consent."
- Non-query-able: "Consent form and information sheets will be translated into Malay and copies provided to the patient"
- Not_a_criteria: "Consent form and information sheets will be translated into Malay and copies provided to the patient."
- Post-eligibility: "Written informed consent from patient or attending relative able to and willing to give informed consent."